一位 75 歲的方先生，患有糖尿病、高膽固醇血症、攝護腺肥大及憂鬱症。下列何種抗憂鬱藥是最佳選擇？
A. imipramine
B. clonazepam
C. venlafaxine
D. trazodone

正確答案：C. venlafaxine